林	士，64歲，過去除自然生產	次外無特殊疾病史，因陰道大量出血至急診求診，經內診發現子宮頸有一個2公分腫瘤，	片證實為子宮頸	上皮癌，腫瘤範圍至下1/3陰道後壁，左側子宮旁組織有腫瘤侵犯跡象，胸部X光正常，腎盂攝影顯示左側腎盂及輸尿管水腫，下列何者為最適當的治療？
A. 放射線合併cisplatin化學治療
B. 放射線治療
C. 使用topotecan化學治療
D. 根除性子宮切除手術合併術後放射線治療

正確答案：A. 放射線合併cisplatin化學治療